Seleccionamos una muestra aleatoria entre los pacientes que acuden a vacunarse de la gripe durante la campaña anual en un centro de salud. Se registra en los pacientes seleccionados si están utilizando fármacos hipolipemiantes y si están diagnosticados de diabetes mellitus, entre otros datos. Se obtiene que la diabetes mellitus es más frecuente entre los pacientes que toman hipolipemiantes que entre los que no los toman. ¿A cuál de los siguientes corresponde el diseño de este estudio?
1. Un estudio de prevalencia.
2. Un estudio de casos y controles.
3. Un estudio de cohortes prospectivo.
4. Un ensayo clínico aleatorizado.

Respuesta correcta: 1. Un estudio de prevalencia.